With confirmed diagnosis of stage II colon cancer.

The above is a clinical trial inclusion criterion. Annotated with entity spans:
With confirmed diagnosis of [Qualifier: stage II] [Condition: colon cancer].